下列的局部麻醉劑（local anesthetics）中，那一項屬於酯類（esters）？
A. Tetracaine
B. Bupivacaine
C. Lidocaine
D. Prilocaine

正確答案：A. Tetracaine